Clinical trial inclusion criterion:
Patients underwent percutaneous coronary intervention with drug-eluting stent;

Entity relations:
- AND("percutaneous coronary intervention", "drug-eluting stent")